Clinical trial exclusion criterion:
Prior stroke with functional impairment or other severe, uncontrolled medical problems that may impair ability to participate in the study exams, based on medical history and review of medical records

Annotated entities:
- Condition: "stroke"
- Condition: "functional impairment"
- Non-query-able: "other severe, uncontrolled medical problems that may impair ability to participate in the study exams, based on medical history and review of medical records"